Describe the Match BAM to VCF (MBV) method.

MBV (Match BAM to VCF) is a method to quickly solve sample mislabeling and detect cross-sample contamination and PCR amplification bias.